強迫症終其一生最常合併那種精神疾病？
A. 恐慌症
B. 社交恐懼症
C. 憂鬱症
D. 酒精成癮

正確答案：C. 憂鬱症